Clinical trial exclusion criterion:
Patient unable to communicate or to understand the study

Annotated entities:
- Post-eligibility: "Patient unable to communicate or to understand the study"